對於睡眠呼吸病症症候群的診斷，下列何種偵測檢查可作為簡易篩選工具？
A. 夜晚鼻腔氣流
B. 夜晚胸腔體積描記
C. 夜晚血氧飽和度
D. 夜晚吐氣二氧化碳分壓

正確答案：C. 夜晚血氧飽和度